環狀軟骨（cricoid cartiage）相對於何脊椎骨高度？
A. C2
B. C4
C. C6
D. T1

正確答案：C. C6